Clinical diagnosis of calculous cholecystitis.

The above is a clinical trial inclusion criterion. Annotated with entity spans:
[Qualifier: Clinical diagnosis] of [Condition: calculous cholecystitis].